Significant renal disease manifested by serum creatinine > 2.5 mg/dL

The above is a clinical trial exclusion criterion. Annotated with entity spans:
[Qualifier: Significant] [Condition: renal disease] manifested by [Measurement: serum creatinine] [Value: > 2.5 mg/dL]